婦人在乳房摸到一腫塊，下列敘述何者錯誤？
A. 皮膚凹陷（skin dimpling）較腫瘤硬度對乳癌的陽性預測值高
B. 若無皮膚凹陷（skin dimpling），即可排除乳癌可能
C. 若腋下摸到淋巴結則乳癌可能性增高
D. 皮膚凹陷（skin dimpling）的發生與Cooper's ligament有關

正確答案：B. 若無皮膚凹陷（skin dimpling），即可排除乳癌可能